關於人類絨毛膜性腺刺激素（human chorionic gonadotropin, hCG）之敘述，下列何者錯誤？
A. 作用於黃體細胞的LH受體上
B. 由已經	床之胚胎的滋養層細胞（trophoblasts）所製造與分泌
C. 在體內代謝的半衰期比LH短
D. 黃體救援（luteal rescue）最主要的激素

正確答案：C. 在體內代謝的半衰期比LH短